Clinical trial exclusion criterion:
Decompensated cirrhosis defined by the presence of actual or previous history of clinical decompensation including ascites, hepatic encephalopathy, variceal bleeding or spontaneous bacterial peritonitis, or a Child-Pugh B or C.

Entity relations:
- Has_qualifier("cirrhosis", "Decompensated")
- Has_value("Child-Pugh", "B or C")
- Subsumes("clinical decompensation", "ascites")
- AND("Decompensated", "clinical decompensation")
- Has_temporal("clinical decompensation", "actual")
- OR("ascites", "hepatic encephalopathy", "variceal bleeding", "spontaneous bacterial peritonitis", "Child-Pugh")
- OR("actual", "previous")